Clinical trial exclusion criterion:
history of ketoacidosis or metabolic acidosis

Entity relations:
- OR("ketoacidosis", "metabolic acidosis")